3. Patients with chronic heart failure (NYHA class II or III);

The above is a clinical trial inclusion criterion. Annotated with entity spans:
3. Patients with [Condition: chronic heart failure] ([Measurement: NYHA] [Value: class II or III]);